Inability to follow the protocol and comply with follow-up requirements or any other reason that the investigator feels would place the patient at increased risk;

The above is a clinical trial exclusion criterion. Annotated with entity spans:
[Observation: Inability to follow the protocol] and comply with follow-up requirements or any other reason that the investigator feels would place the patient at increased risk;